交感神經釋放出 norepinephrine 作用在β1 receptor，導致 cAMP 增加，protein kinase A 活化後，會磷 酸化下列何種蛋白使心肌收縮力增強？
A. L-type Ca2+ channel
B. lipase
C. glycogen phosphorylase
D. guanylate cyclase

正確答案：A. L-type Ca2+ channel